Clinical trial inclusion criterion:
Spontaneous breathing activity of at least 6 breaths/minute

Annotated entities:
- Measurement: "Spontaneous breathing activity"
- Value: "at least 6 breaths/minute"